contraindicate to ketamine

The above is a clinical trial exclusion criterion. Annotated with entity spans:
[Condition: contraindicate] to [Drug: ketamine]